Has an active infection requiring systemic therapy

The above is a clinical trial exclusion criterion. Annotated with entity spans:
Has an [Condition: active infection] requiring systemic therapy